Clinical trial inclusion criteria:
All patients admitted at the Gynecological emergency Unit at Hospital de Clínicas de Porto Alegre scheduled for uterine evacuation with <12 weeks of gestation.

Annotated entities:
- Visit: "Gynecological emergency Unit at Hospital de Clínicas de Porto Alegre"
- Procedure: "uterine evacuation"
- Condition: "gestation"
- Multiplier: "<12 weeks"